Clinical trial exclusion criterion:
obviously poor compliance.

Annotated entities:
- Qualifier: "obviously"
- Observation: "poor compliance"